當開立麻醉止痛藥（narcotic analgesic）給癌末病人時，下列何者是最需要同時開立之藥物？
A. 預防便祕之藥物
B. 加強鎮靜（sedation）作用之藥物
C. 預防頭暈之藥物
D. 抗憂鬱劑

正確答案：A. 預防便祕之藥物